¿Cómo se denominó al grupo de mujeres que surgió en Europa en el siglo XII y que tuvo gran importancia en los cuidados de pobres y enfermos?:
1. Diaconisas.
2. Hermanas de la Caridad.
3. Beguinas.
4. Siervas Seglares.

Respuesta correcta: 3. Beguinas.